Which animal bite can cause Capnocytophaga canimorsus infection?

Capnocytophaga canimorsus infection is typically associated with dog bites, especially in asplenic or immunocompromised patients, and typically manifest as sepsis and/or bacteremia.